What is drug target for olaparib?

Olaparib is a Poly(ADP-ribose) Polymerase (PARP) Inhibitor